Clinical trial exclusion criterion:
All residents residing near to the well sites that are randomly selected for this study.

Entity relations:
- AND("residing", "near to the well sites")